Patients for whom the need of pressure infusions are expected

The above is a clinical trial exclusion criterion. Annotated with entity spans:
[Non-representable: Patients for whom the need of pressure infusions are expected]